Clinical trial inclusion criterion:
2. Left ventricular ejection fraction (LVEF) ≤ 40% (ECHO);

Entity relations:
- Has_value("Left ventricular ejection fraction (LVEF)", "≤ 40%")
- AND("Left ventricular ejection fraction (LVEF)", "ECHO")